Clinical trial exclusion criterion:
patients with infected miscarriage/abortion (presence of fever, pus from the cervix, leukocytosis [> 14000]);

Entity relations:
- Has_qualifier("miscarriage", "infected")
- Has_temporal("leukocytosis", "> 14000")
- AND("miscarriage", "fever")
- OR("miscarriage", "abortion")
- OR("fever", "pus from the cervix", "leukocytosis")